一位工人被送至急診，懷疑不慎接觸到氰化物導致中毒（cyanide poisoning）。下列有關氰化物中毒之敘述，何者正確？
A. 吸入氰化物氣體不易中毒，因肺組織有大量的解毒系統
B. 氰化物會與細胞色素C氧化酶（cytochrome c oxidase）中之血紅素a3（heme a3）的Fe3+牢牢結合，造成電子無法傳遞、粒線體呼吸及能量產生因而停止，造成細胞死亡
C. 解毒劑如亞硝酸鈉（sodium nitrite）是將變性血紅素蛋白（methemoglobin）轉化為氧化血紅素蛋白（oxyhemoglobin）
D. 神經系統不會受到影響

正確答案：B. 氰化物會與細胞色素C氧化酶（cytochrome c oxidase）中之血紅素a3（heme a3）的Fe3+牢牢結合，造成電子無法傳遞、粒線體呼吸及能量產生因而停止，造成細胞死亡